Hypersensitivity to Sandostatin or any component of the formulation.

The above is a clinical trial exclusion criterion. Annotated with entity spans:
[Condition: Hypersensitivity] to [Drug: Sandostatin] or any [Drug: component of the formulation].